Patients unable to understand the objectives of the dietary intervention

The above is a clinical trial exclusion criterion. Annotated with entity spans:
[Non-query-able: Patients unable to understand the objectives of the dietary intervention]